Clinical trial inclusion criteria:
Patients with SOF/VEL treatment for the treatment of chronic HCV genotype 1 through 6.
Patient is at least 18 at the day of screening.
Patient is able and willing to sign the Informed Consent Form.
Patient is able and willing to follow protocol requirements.

Annotated entities:
- Procedure: "SOF/VEL treatment"
- Qualifier: "chronic"
- Measurement: "HCV genotype"
- Value: "1 through 6"
- Temporal: "at least 18 at the day of screening"
- Reference_point: "screening"
- Post-eligibility: "Patient is able and willing to sign the Informed Consent Form"
- Post-eligibility: "Patient is able and willing to follow protocol requirements"